Known history or present abuse of alcohol or drugs

The above is a clinical trial exclusion criterion. Annotated with entity spans:
Known [Temporal: history] or [Temporal: present] [Condition: abuse of alcohol] or drugs